有關早產兒壞死性腸炎（necrotizing enterocolitis），下列的處置方式何者錯誤？
A. 馬上禁食且行口胃管（orogastric tube）減壓
B. 需使用廣效性抗生素
C. 所有病患均需接受手術治療
D. 需補充水分及電解質

正確答案：C. 所有病患均需接受手術治療